HBsAg negative/HBcAb positive/hepatitis B virus DNA negative at baseline

The above is a clinical trial inclusion criterion. Annotated with entity spans:
[Measurement: HBsAg] [Value: negative]/[Measurement: HBcAb] [Value: positive]/[Measurement: hepatitis B virus DNA] [Value: negative] [Temporal: at baseline]